根據流行病學研究，產生心臟衰竭的最主要原因是：
A. 高血壓與冠狀動脈疾病
B. 瓣膜性疾病與高血壓
C. 先天性心臟病與瓣膜性疾病
D. 先天性心臟病與冠狀動脈心臟病

正確答案：A. 高血壓與冠狀動脈疾病